Which curated databases exist for spider-venom toxins?

ArachnoServer and its updated version ArachnoServer 2.0 are manually curated databases providing information on the sequence, structure and biological activity of protein toxins from spider venoms.